Clinical trial inclusion criterion:
Systolic heart failure with New York Heart Association (NYHA) class II-III.

Annotated entities:
- Condition: "Systolic heart failure"
- Measurement: "New York Heart Association (NYHA)"
- Value: "class II-III"